Deriva de los monocitos de la sangre:
1. Astrocito protoplasmático.
2. Astrocito fibroso.
3. Oligodendrocito.
4. Microgliocito.
5. Célula satélite.

Respuesta correcta: 4. Microgliocito.